下列關於恐慌症（panic disorder）的治療，何者正確？
A. 認知行為治療（cognitive behavioral therapy）效果不佳
B. 苯二氮平類（benzodiazepines）的藥物治療效果好，故在治療第4～12週後可將劑量往上調
C. 選擇性血清素再吸收抑制劑（SSRI）對恐慌症有不錯的療效
D. 使用alprazolam治療，其成癮性低

正確答案：C. 選擇性血清素再吸收抑制劑（SSRI）對恐慌症有不錯的療效